Known allergic reaction to tranexamic acid

The above is a clinical trial exclusion criterion. Annotated with entity spans:
Known [Condition: allergic] reaction to [Drug: tranexamic acid]